Clinical trial exclusion criterion:
A prescription of a NOAC within 90 days prior to hospitalization or outpatient clinic visit for VTE.

Annotated entities:
- Drug: "NOAC"
- Temporal: "within 90 days prior to hospitalization or outpatient clinic visit for VTE"
- Condition: "VTE"
- Reference_point: "hospitalization or outpatient clinic visit for VTE"
- Procedure: "hospitalization"
- Procedure: "outpatient clinic visit"
- Visit: "outpatient clinic"
- Visit: "hospitalization"